臨床上對於關節炎手部受損的病人常使用副木（splint）來達到下述目的，但何者錯誤？
A. 可減緩手部的變形
B. 可增進抓握能力
C. 可協助手功能
D. 可延緩疾病的進行

正確答案：D. 可延緩疾病的進行